Clinical trial inclusion criterion:
A pregnancy of unknown location is defined as a pregnancy in a woman with a positive pregnancy test but no definitive signs of pregnancy in the uterus or adnexa on ultrasound imaging. A definitive sign of gestation includes ultrasound visualization of a gestational sac with a yolk sac (with or without an embryo) in the uterus or in the adnexa. Ultrasound must be performed within 7 days prior to randomization.

Entity relations:
- Has_value("pregnancy test", "positive")
- Has_qualifier("pregnancy", "unknown location")
- Has_index("within 7 days prior to randomization", "randomization")
- Has_temporal("Ultrasound", "within 7 days prior to randomization")